Clinical trial exclusion criterion:
Severe renal impairment.

Annotated entities:
- Qualifier: "Severe"
- Condition: "renal impairment"